Clinical trial inclusion criterion:
Age18-65

Entity relations:
- Has_value("Age", "18-65")